El herbicida paraquat produce principalmente:
1. Daño pulmonar.
2. Anormalidades hematológicas.
3. Neurotoxicidad.
4. Toxicidad ocular.
5. Ototoxicidad.

Respuesta correcta: 1. Daño pulmonar.